關於肌強直營養不良（myotonic dystrophy），下列敘述何者錯誤？
A. 自體顯性遺傳
B. 以近端無力為主，常見複視
C. 經常合併多系統疾病，例如白內障、糖尿病、心律不整等
D. 血液中的肌肉酵素一般是正常或輕微上升

正確答案：B. 以近端無力為主，常見複視